No allergies to any test foods

The above is a clinical trial inclusion criterion. Annotated with entity spans:
[Negation: No] [Condition: allergies] to any [Observation: test foods]